Clinical trial inclusion criterion:
=1 appropriate ICD shocks,

Annotated entities:
- Multiplier: "=1"
- Procedure: "ICD shocks"